Clinical trial exclusion criterion:
Allergy to Glitazones

Annotated entities:
- Drug: "Glitazones"
- Condition: "Allergy"